La fobia social es un problema:
1. Infrecuente en la población general (menos del 1%).
2. Más frecuente entre la población masculina que en la femenina.
3. Más frecuente entre la población femenina que la masculina.
4. Que se da por igual en los dos sexos.
5. Más frecuente después de los 25 años que con anterioridad a tal edad.

Respuesta correcta: 3. Más frecuente entre la población femenina que la masculina.